下列有關急性腹症（acute abdomen）之敘述，何者錯誤？
A. 身體檢查發現肚臍周圍瘀青（periumbilical bruising）稱為Courvoisier's sign
B. 急性膽囊炎（acute cholecystitis）之轉移痛 (referred pain）會轉移至右胸
C. 消化性潰瘍穿孔（perforated peptic ulcer）之轉移痛 (referred pain）會轉移至右側腰部
D. mesenteric thrombosis or embolism引起之急性腹症需立刻施行手術

正確答案：A. 身體檢查發現肚臍周圍瘀青（periumbilical bruising）稱為Courvoisier's sign